What is IDD in relation to organ transplantation?

Imminent death donation (IDD) has been proposed as a separate category of organ donation: distinct from living donation and donation after cardiac death